Clinical trial inclusion criterion:
=3 VT episodes within 24 hours

Annotated entities:
- Multiplier: "3 episodes"
- Condition: "VT"
- Temporal: "within 24 hours"